有關多發性內分泌贅瘤症候群（multiple endocrine neoplasia，MEN）的敘述，下列何者錯誤？
A. MEN 1包含副甲狀腺機能亢進（hyperparathyroidism）
B. MEN 2A包含甲狀腺髓質癌（medullary thyroid carcinoma）
C. MEN 2B包含甲狀腺髓質癌（medullary thyroid carcinoma）
D. MEN 2C包含嗜鉻細胞瘤（pheochromocytoma）

正確答案：D. MEN 2C包含嗜鉻細胞瘤（pheochromocytoma）